Clinical trial exclusion criterion:
Un-controlled progressive pathology.

Annotated entities:
- Non-query-able: "Un-controlled progressive pathology"